一位34歲女性，G0（gravida），已嘗試懷孕3年都未能成功受孕。她有多年骨盆腔疼痛及嚴重的性交疼痛（dyspareunia）。骨盆腔檢查發現nodular and tender uterosacral ligament，子宮後傾（retroverted）但大小正常，以及右側附屬物腫塊。陰道超音波發現一個6公分的右側卵巢腫瘤。抽血檢查方面，CA 125指數上升。接下來最適當的處置為下列何者﹖
A. 促性腺激素釋放荷爾蒙類似體（GnRH agonist）
B. 診斷性腹腔鏡手術（diagnostic laparoscopy）
C. 腹腔鏡卵巢囊腫切除術（laparoscopy with cystectomy）
D. 腹腔鏡右側卵巢切除術（laparoscopy and right oophorectomy）

正確答案：C. 腹腔鏡卵巢囊腫切除術（laparoscopy with cystectomy）